Las partículas de reconocimiento de la señal tienen como función:
1. Romper la secuencia señal.
2. Detectar las proteínas citosólicas.
3. Dirigir las secuencias señal a los ribosomas.
4. Unir los ribosomas al retículo endoplásmico.
5. Unir el mRNA a los ribosomas.

Respuesta correcta: 4. Unir los ribosomas al retículo endoplásmico.